一位10歲兒童因發燒2天及起疹子至急診就醫，檢查時發現疹子型態有maculae、papulae和vesicles等，下列何者敘述最不恰當？
A. 由Herpes virus引起
B. 疹子出現後開始具傳染性
C. 可能產生的併發症包括腦炎、肺炎
D. 避免使用aspirin治療

正確答案：B. 疹子出現後開始具傳染性